Clinical trial exclusion criterion:
1. Had a neurological condition other than that associated with their pain diagnosis which, in the opinion of the investigator, would interfere with their ability to participate in the study

Entity relations:
- multi("associated with their pain diagnosis", "pain diagnosis")
- Has_qualifier("other than", "associated with their pain diagnosis")
- Has_qualifier("neurological condition", "associated with their pain diagnosis")